Clinical trial exclusion criterion:
hiatal hernia repair with posterior cruroplasty

Annotated entities:
- Condition: "hiatal hernia"
- Procedure: "repair"
- Procedure: "posterior cruroplasty"